下列有關肝細胞腺瘤（liver cell adenoma）敘述，何者為非？
A. 最常發生在 20 歲至 40 歲女性
B. 長期服用口服避孕藥可能增加其發生機率
C. 主要的危險在於破裂導致內出血
D. 沒有惡性轉化（malignant transformation）的可能

正確答案：D. 沒有惡性轉化（malignant transformation）的可能